Clinical trial inclusion criterion:
HBsAg and HBeAg positive for more than 6 months, HBV DNA detectable with ALT level abnormal lasted for three months and at least time190 IU/L or liver puncture biopsy demonstrated apparent inflammation, never treated before enrolled.

Annotated entities:
- Condition: "HBeAg positive"
- Condition: "HBsAg positive"
- Temporal: "for more than 6 months"
- Condition: "HBV DNA detectable"
- Measurement: "ALT level"
- Value: "abnormal"
- Temporal: "lasted for three months"
- Temporal: "at least time"
- Value: "190 IU/L"
- Procedure: "liver puncture biopsy"
- Condition: "inflammation"
- Negation: "never"
- Procedure: "treated"
- Temporal: "before enrolled"